Clinical trial inclusion criterion:
echocardiographic structural (a left atrial volume index > 34 mL/m2 or a left ventricular mass index =115 g/m2 for males and =95 g/m2 for females) or functional alterations (E/e'=13 and a mean e' septal and lateral wall < 9 cm/s).

Annotated entities:
- Measurement: "echocardiographic structural"
- Measurement: "left atrial volume inde"
- Value: "> 34 mL/m2"
- Measurement: "left ventricular mass index"
- Value: "=115 g/m2"
- Person: "males"
- Person: "females"
- Measurement: "left ventricular mass index"
- Value: "=95 g/m2"
- Measurement: "functional alterations"
- Measurement: "E/e'"
- Value: "=13"
- Measurement: "mean e' septal and lateral wall"
- Value: "< 9 cm/s"